Expected duration of hospital stay and time on steroids >= 3 days

The above is a clinical trial inclusion criterion. Annotated with entity spans:
[Measurement: Expected duration of hospital stay] and [Measurement: time on steroids] [Value: >= 3 days]